Body mass index (BMI) from 18 to 35kg/m2

The above is a clinical trial inclusion criterion. Annotated with entity spans:
[Measurement: Body mass index] ([Measurement: BMI]) [Value: from 18 to 35kg/m2]